Clinical trial inclusion criterion:
self-reported healthy adults between the ages of 18-60 who are fluent in English.

Annotated entities:
- Condition: "healthy"
- Person: "adults"
- Person: "ages"
- Value: "between 18-60"
- Observation: "fluent in English"
- Qualifier: "self-reported"